Clinical trial exclusion criterion:
drug-alcoholics addiction ;

Annotated entities:
- Condition: "alcoholics addiction"
- Condition: "addiction drug"